Clinical trial exclusion criterion:
The aged patients with bad heart and lung function.

Entity relations:
- AND("aged", "bad lung function")
- OR("bad lung function", "bad heart function")